Clinical trial exclusion criterion:
Clinically significant medical history

Annotated entities:
- Temporal: "medical history"
- Qualifier: "Clinically significant"